Clinical trial exclusion criterion:
Patients with sick sinus syndrome (SSS) or high degree AV block without pacemaker protection

Annotated entities:
- Condition: "sick sinus syndrome"
- Condition: "SSS"
- Condition: "AV block"
- Qualifier: "high degree"
- Procedure: "pacemaker"
- Negation: "without"